下列有關乳房腫瘤細針穿刺（fine needle aspiration）檢查之敘述，何者錯誤？
A. 用16或18號針頭（16 or 18 gauge needle）
B. 不需局部麻醉
C. 可區分實質腫瘤或囊腫（solid tumor or cyst）
D. 若發現有癌細胞（carcinoma cell ) 仍需作切片檢查（tumor biopsy）

正確答案：A. 用16或18號針頭（16 or 18 gauge needle）